Clinical trial exclusion criterion:
patient known and treated for sleep apnea syndrome

Annotated entities:
- Condition: "sleep apnea syndrome"
- Procedure: "treated"